足月兒之生理性黃疸，黃疸數值尖峰通常於何時出現？
A. 出生6小時內
B. 出生12小時內
C. 出生24小時內
D. 出生2～5天內

正確答案：D. 出生2～5天內